Albumin < 3g/dl or platelet count < 75 x 103/mL

The above is a clinical trial exclusion criterion. Annotated with entity spans:
[Measurement: Albumin] [Value: < 3g/dl] or [Measurement: platelet count] [Value: < 75 x 103/mL]